Clinical trial inclusion criterion:
Patients who require at least 80% of their caloric intake as PN at study start, and in whom an indication for PN is expected for at least 5 days

Annotated entities:
- Value: "at least 80% of caloric intake"
- Procedure: "PN"
- Temporal: "at study start"
- Condition: "indication"
- Procedure: "PN"
- Multiplier: "for at least 5 days"
- Mood: "expected"